一位 48 歲女性主訴胸悶，偶有眩暈並有運動時呼吸困難，身體診察脈搏每分鐘 64 次，心臟大小正常，有 S4 gallop，在胸骨右緣第二肋間有 grade III/VI 收縮期射出型心雜音（systolic ejection murmur），向頸部放散。血行動力學檢查如下（壓力單位，mmHg）：右心房平均壓：6；右心室：43/8；肺動脈：43/18（平均壓 28）；肺動脈楔壓：平均壓 22；左心室 227/33；主動脈 139/72 （平均壓 98），則病人之心臟病診斷為何？
A. 僧帽瓣狹窄（mitral stenosis）
B. 僧帽瓣閉鎖不全（mitral insufficiency or regurgitation）
C. 主動脈瓣狹窄（aortic stenosis）
D. 主動脈瓣閉鎖不全（aortic insufficiency or regurgitation）

正確答案：C. 主動脈瓣狹窄（aortic stenosis）